En una zona básica de salud se han detectado 10 casos de gripe en el mes de junio. Esta forma de presentación de la enfermedad transmisible se define como:
1. Epidemia.
2. Hipoendemia.
3. Mesoendemia.
4. Esporádica.
5. Pandemia.

Respuesta correcta: 4. Esporádica.